下列何種先天性心臟病，不是使用前列腺素 E1（prostaglandin E1）的適應症？
A. 全殘存動脈幹（truncus arteriosus）
B. 單純大血管轉位（isolated D-transposition of great vessels）
C. 左心室發育不良症（hypoplastic left heart syndrome）
D. 肺動脈瓣閉鎖合併心室中隔缺損（valvular pulmonary atresia with VSD）

正確答案：A. 全殘存動脈幹（truncus arteriosus）